Active bacterial endocarditis within 6 months (180 days) of procedure.

The above is a clinical trial exclusion criterion. Annotated with entity spans:
[Temporal: Active] [Condition: bacterial endocarditis] [Temporal: within 6 months (180 days) of procedure].